Patient already participating in an other therapeutic trial with an experimental drug

The above is a clinical trial exclusion criterion. Annotated with entity spans:
[Context_Error: Patient already participating in an other therapeutic trial with an experimental drug]